Clinical trial exclusion criterion:
Subject with a penile anatomical abnormality (e.g., penile fibrosis, fractures, or Peyronie's disease) which, in the investigator's opinion, could significantly impair sexual performance. This will be based on subject's reported medical history (penile exam not required)

Annotated entities:
- Condition: "penile anatomical abnormality"
- Condition: "penile fibrosis"
- Condition: "penile fractures"
- Condition: "Peyronie's disease)"
- Non-representable: "in the investigator's opinion"
- Qualifier: "could significantly impair sexual performance"
- Procedure: "penile exam"
- Condition: "impair sexual performance"